抗體與抗原分子結合時的反應力不包含下列那一項？
A. 共價鍵結（covalent bond）
B. 氫鍵結（hydrogen bond）
C. 疏水性反應力（hydrophobic force）
D. 凡得瓦力（van der Waals force）

正確答案：A. 共價鍵結（covalent bond）